Clinical trial inclusion criterion:
Healthy male and/or female subjects between the ages of 18 and 55 years, and a body mass index (BMI) of ≥ 18 and ≤ 33 kg/m2 with body weight ≥ 50 and ≤ 90 kg at screening.

Entity relations:
- Has_value("ages", "between 18 and 55 years")
- Has_value("body mass index (BMI)", "≥ 18 and ≤ 33 kg/m2")
- Has_value("body weight", "≥ 50 and ≤ 90 kg")
- Has_index("at screening", "screening")
- Has_temporal("body mass index (BMI)", "at screening")
- Has_temporal("body weight", "at screening")
- OR("male", "female")